Patients aged of 18 and over,

The above is a clinical trial inclusion criterion. Annotated with entity spans:
Patients [Person: aged] of [Value: 18 and over],